Clinical trial inclusion criteria:
Pregnant women with abdomen discumfort and ultrasound diagnosis of polyhydramnios (AFI>25cm)
Single or twin pregnancies

Annotated entities:
- Condition: "Pregnant"
- Person: "women"
- Condition: "abdomen discumfort"
- Procedure: "ultrasound"
- Condition: "polyhydramnios"
- Measurement: "AFI"
- Value: ">25cm"
- Value: "diagnosis"
- Condition: "pregnancies"
- Value: "Single"
- Value: "twin"